What is Leptomeningeal disease?

Neoplastic leptomeningeal disease (LMD) represents infiltration of the leptomeninges by tumor cells.